Clinical trial exclusion criterion:
Unwillingness or doubtful capacity to comply with the protocol

Annotated entities:
- Post-eligibility: "Unwillingness or doubtful capacity to comply with the protocol"